有關成人多囊性腎疾病（adult polycystic kidney disease）之敘述，下列何者錯誤？
A. 多數與 polycystin 1、2 基因突變有關
B. 與腎小管上皮細胞不正常的生長及分化有關
C. 很多病人直到腎臟衰竭時才被發現
D. 約 5%病人會合併肝臟的多囊性疾病

正確答案：D. 約 5%病人會合併肝臟的多囊性疾病